disease duration of at least 5 years.

The above is a clinical trial inclusion criterion. Annotated with entity spans:
[Measurement: disease duration] of [Value: at least 5 years].